原發性粘連性肩部關節囊炎（idiopathic adhesive capsulitis）亦稱為冰凍肩（frozen shoulder）。有關此症的敘述，下列何者錯誤？
A. 典型的患者是大約 40～60 歲的女性
B. 較易發生於非慣用側（nondominant side）
C. 做關節造影（arthrography）檢查時，可發現腋窩處關節囊發炎脹大，充滿造影劑
D. 多數病例之症狀可以自行緩解消失，為自限性（self-limiting）疾病

正確答案：C. 做關節造影（arthrography）檢查時，可發現腋窩處關節囊發炎脹大，充滿造影劑